Clinical trial exclusion criterion:
Pregnant or breast feeding women

Annotated entities:
- Condition: "Pregnant"
- Condition: "breast"